Clinical trial exclusion criterion:
Any other reason, which in the opinion of the Investigator would confound proper evaluation of the study.

Annotated entities:
- Subjective_judgement: "Any other reason, which in the opinion of the Investigator would confound proper evaluation of the study."
- Non-query-able: "Any other reason, which in the opinion of the Investigator would confound proper evaluation of the study."